Clinical trial exclusion criterion:
Panel reacting antibodies(PRA) >25% in most recent test or considered to be of high risk for rejection which requires an enhanced immunosuppression.

Entity relations:
- Has_temporal("Panel reacting antibodies(PRA)", "most recent test")
- Has_value("Panel reacting antibodies(PRA)", ">25%")
- AND("rejection", "enhanced immunosuppression")
- Has_mood("rejection", "considered to be of high risk")
- OR("Panel reacting antibodies(PRA)", "rejection")